Clinical trial exclusion criterion:
Known thrombocytopenia, contraindicating intramuscular vaccination

Annotated entities:
- Condition: "thrombocytopenia"
- Condition: "contraindicating"
- Procedure: "intramuscular vaccination"